在臺灣地區未有肝膽疾病之病人，如罹患原發性肝膿瘍，其最可能的致病菌是：
A. 金黃色葡萄球菌（staphylococcus aureus）
B. A族鏈球菌（group A streptococcus）
C. 大腸桿菌（E. coli）
D. 克雷白氏肺炎桿菌（Klebsiella pneumoniae）

正確答案：D. 克雷白氏肺炎桿菌（Klebsiella pneumoniae）